Clinical trial inclusion criterion:
Patients with histologically confirmed advanced (stage IV) gastric cancer, NSCLC, breast cancer or ovarian cancer, who choose monotherapy of oral vascular targeting drug (apatinib) due to intolerability or inappropriateness of other therapies;

Annotated entities:
- Qualifier: "histologically confirmed"
- Procedure: "histologically"
- Qualifier: "advanced"
- Qualifier: "stage IV"
- Condition: "gastric cancer"
- Condition: "NSCLC"
- Condition: "breast cancer"
- Condition: "ovarian cancer"
- Procedure: "monotherapy"
- Drug: "oral vascular targeting drug"
- Drug: "apatinib"
- Non-representable: "due to intolerability or inappropriateness of other therapies"